Patients with abnormal TSH concentration

The above is a clinical trial exclusion criterion. Annotated with entity spans:
Patients with [Value: abnormal] [Measurement: TSH] concentration